Immune disorders

The above is a clinical trial exclusion criterion. Annotated with entity spans:
[Condition: Immune disorders]